Clinical trial exclusion criterion:
non-type 1 diabetes mellitus

Annotated entities:
- Condition: "non-type 1 diabetes mellitus"